¿En cuál de estas situaciones considera adecuada la realización de una biopsia renal en la primera recaída de un síndrome nefrótico en un niño?
1. Sensibilidad a corticoides.
2. Presencia de edemas incapacitantes.
3. Presencia de síndrome nefrítico.
4. Comienzo entre los 2 y 6 años de vida.

Respuesta correcta: 3. Presencia de síndrome nefrítico.